Clinical trial inclusion criterion:
1. Patient age ≥ 12 years

Entity relations:
- Has_value("age", "≥ 12 years")